¿Cuál de las siguientes pruebas se utiliza para valorar el funcionamiento del nervio craneal III?:
1. Pida al paciente que siga su dedo con los ojos (sin mover la cabeza) mientras escribe en el aire una H.
2. Compruebe la capacidad del paciente para oler (jabón o café, por ej.) con cada narina.
3. Mantenga cierto número de dedos frente a los ojos del paciente y pregunte cuantos dedos es capaz de distinguir.
4. Susurre unas palabras a cada oído del paciente y pídale que las repita, o frote los dedos pulgar e índice a unos 5 cm de cada pabellón auricular y pregúntele si oye el sonido.

Respuesta correcta: 1. Pida al paciente que siga su dedo con los ojos (sin mover la cabeza) mientras escribe en el aire una H.